Clinical trial exclusion criterion:
3. A history of cardiac disease, as defined by:

Entity relations:
- Has_temporal("cardiac disease", "history")